下列有關細菌性肝膿瘍之敘述，何者錯誤？
A. 常發生於糖尿病病人
B. 細菌經由血循環至肝臟發生膿瘍
C. 可以為單一或多發膿瘍
D. 均須早期接受外科引流手術治療

正確答案：D. 均須早期接受外科引流手術治療